Hepatic insufficiency (Child-Pugh score > 5)

The above is a clinical trial exclusion criterion. Annotated with entity spans:
[Condition: Hepatic insufficiency] ([Measurement: Child-Pugh score] [Value: > 5])